Total cholesterol =300 mg/dL

The above is a clinical trial exclusion criterion. Annotated with entity spans:
[Measurement: Total cholesterol] [Value: =300 mg/dL]